Respiration rate 12-18 breaths per minute

The above is a clinical trial inclusion criterion. Annotated with entity spans:
[Measurement: Respiration rate] [Value: 12-18 breaths per minute]